有關上小腦腳（superior cerebellar peduncle）之敘述，下列何者錯誤？
A. 含有ventral spinocerebellar tract
B. 含有連接小腦與下橄欖核（inferior olivary nucleus）之神經纖維
C. 含有連接小腦與紅核之神經纖維
D. 含有連接小腦與丘腦之神經纖維

正確答案：B. 含有連接小腦與下橄欖核（inferior olivary nucleus）之神經纖維